Clinical trial exclusion criterion:
creatinine level of 1,5 mg/dL or more

Annotated entities:
- Measurement: "creatinine level"
- Value: "1,5 mg/dL or more"